Clinical trial exclusion criterion:
11. Any history of anaphylaxis or severe allergy resulting in angioedema; or a history of sensitivity/allergy to latex

Entity relations:
- Has_qualifier("allergy", "severe")
- Has_temporal("sensitivity to latex", "history")
- causal("angioedema", "anaphylaxis")
- Has_temporal("anaphylaxis", "history")
- OR("sensitivity to latex", "allergy to latex")
- OR("anaphylaxis", "allergy")